corticosteroid use during last 3 months

The above is a clinical trial exclusion criterion. Annotated with entity spans:
[Drug: corticosteroid] use [Temporal: during last 3 months]